下列有關下腔靜脈過濾網（inferior vena cava filter）置放的適應症敘述，何者錯誤？
A. 股靜脈有血栓形成易造成肺栓塞，不論有無抗凝血藥物治療皆須置放
B. 下肢深部靜脈栓塞患者，但不適宜接受抗凝血藥物治療者
C. 慢性肺栓塞合併產生肺高壓之患者
D. 使用抗凝血藥物治療後，仍持續反覆下肢深部靜脈栓塞

正確答案：A. 股靜脈有血栓形成易造成肺栓塞，不論有無抗凝血藥物治療皆須置放